Treprostinil is an analogue for which prostaglandin?

Treprostinil is a prostaglandin I(2) (PGI(2)) analog.